En el caso de un trastorno de anorexia nerviosa, la primera alternativa de elección de tratamiento especializado es:
1. El ingreso hospitalario.
2. El tratamiento ambulatorio.
3. El hospital de día.
4. Los pisos tutelados.

Respuesta correcta: 2. El tratamiento ambulatorio.